Males or non-pregnant, non-nursing females between the ages of 2-65 years

The above is a clinical trial inclusion criterion. Annotated with entity spans:
[Person: Males] or [Pregnancy_considerations: non-pregnant, non-nursing] [Person: females] between the [Person: ages] of [Value: 2-65 years]